消化道中，下列何者可用銀染色法染上？
A. 腸內分泌細胞（enteroendocrine cells）
B. 頸黏液細胞（mucous neck cells）
C. 主細胞（chief cells）
D. 壁細胞（parietal cells）

正確答案：A. 腸內分泌細胞（enteroendocrine cells）